¿Cuál de las afirmaciones siguientes con relación a la molécula de DNA de doble cadena es cierta?
1. Todos los grupos hidroxilo de las pentosas participan en los enlaces.
2. Las bases son perpendiculares al eje.
3. Cada cadena es idéntica.
4. Cada cadena es paralela.
5. Cada cadena se replica a sí misma.

Respuesta correcta: 2. Las bases son perpendiculares al eje.